Clinical trial exclusion criterion:
Cancer requiring treatment in past year (except skin)

Entity relations:
- AND("Cancer", "treatment")
- Has_temporal("Cancer", "past year")